Patient currently requires dialysis

The above is a clinical trial exclusion criterion. Annotated with entity spans:
Patient currently requires [Procedure: dialysis]